細胞中各種基因的表達常因不同組織而有差異。在一些基因的啟動子（promoter）上常有一些 CpG 島（CpG island）。同一基因的表達，常因 CpG 島受到下列何種修飾（modification）而有不同？
A. 乙烯化（acetylation）
B. 甲基化（methylation）
C. 磷酸化（phosphorylation）
D. 羧化（carboxylation）

正確答案：B. 甲基化（methylation）